Clinical trial inclusion criterion:
Subjects with a history of moderate to severe psoriatic disease

Annotated entities:
- Qualifier: "moderate"
- Qualifier: "severe"
- Condition: "psoriatic disease"
- Temporal: "history"